Previous myocardial infarction (MI) or a percutaneous coronary intervention PCI within the past 3 months

The above is a clinical trial exclusion criterion. Annotated with entity spans:
Previous [Condition: myocardial infarction] ([Condition: MI]) or a [Procedure: percutaneous coronary intervention] [Procedure: PCI] [Temporal: within the past 3 months]